Existence of a contraceptive method for women of child-bearing age

The above is a clinical trial inclusion criterion. Annotated with entity spans:
Existence of a [Device: contraceptive method] for [Person: women] of [Value: child-bearing] [Person: age]